Normal motor and cognitive development up to time of injury

The above is a clinical trial inclusion criterion. Annotated with entity spans:
[Value: Normal] [Measurement: motor] and [Measurement: cognitive development] [Temporal: up to time of injury]